Clinical trial inclusion criterion:
no written informed consent

Annotated entities:
- Non-query-able: "no written informed consent"